Serious comorbidities preventing prescription of paracetamol

The above is a clinical trial exclusion criterion. Annotated with entity spans:
[Qualifier: Serious] [Condition: comorbidities] [Condition: preventing] prescription of [Drug: paracetamol]